在電子傳遞鏈中，下列何種物質會將其所攜帶的電子直接傳遞給氧分子（O2）？
A. NADH
B. FADH2
C. Coenzyme Q
D. Cytochrome C

正確答案：D. Cytochrome C